Clinical trial inclusion criterion:
All subjects will be in good general health and able to participate in the LP and imaging exams. This determination is made by the study neurologist and reviewed at a consensus meeting for each subject.

Entity relations:
- AND("able to participate", "imaging exams")
- AND("able to participate", "LP")